Clinical trial inclusion criterion:
Not using medically approved contraception (including abstinence) if female and of childbearing age

Entity relations:
- Has_qualifier("contraception", "medically approved")
- Subsumes("contraception", "abstinence")
- Has_value("age", "childbearing")
- multi("childbearing age", "childbearing age")
- Has_negation("contraception", "Not")
- AND("female", "contraception")
- multi("childbearing age", "age")